Clinical trial exclusion criterion:
Subject previously enrolled to this study.

Annotated entities:
- Non-query-able: "Subject previously enrolled to this study."